Clinical trial inclusion criterion:
intramural leiomyomas with an ultrasonographic size <20 cm but >4cm,

Entity relations:
- Has_value("ultrasonographic size", "<20 cm but >4cm")